¿Qué dos grandes categorías de síndromes distingue la clasificación empírica de la psicopatología infantil promovida por Achenbach?:
1. Trastornos afectivos y trastornos de conducta.
2. Trastornos socializados y trastornos no socializados.
3. Trastornos internalizados y externalizados.
4. Retraimiento y problemas sociales.

Respuesta correcta: 3. Trastornos internalizados y externalizados.